serious mental disorder

The above is a clinical trial exclusion criterion. Annotated with entity spans:
[Condition: serious mental disorder]